History of morphine allergy

The above is a clinical trial exclusion criterion. Annotated with entity spans:
[Temporal: History] of [Drug: morphine] [Condition: allergy]